1997 年 AJCC TNM 系統於腎細胞癌之分期中，T1 與 T2 期腫瘤大小之分界為：
A. 2.5 公分
B. 5 公分
C. 7 公分
D. 10 公分

正確答案：C. 7 公分